Clinical trial inclusion criterion:
endovascular mechanical thrombus fragmentation + thrombolytic therapy (using recombinant tissue activator of plasminogen), performed for treatment of the above-mentioned pulmonary embolism in less than 48 hours before randomization. The patient should be randomized no earlier than 24 hours after procedures endovascular mechanical thrombus fragmentation + thrombolytic therapy

Annotated entities:
- Condition: "endovascular mechanical thrombus fragmentation"
- Procedure: "thrombolytic therapy"
- Drug: "recombinant tissue activator of plasminogen"
- Temporal: "in less than 48 hours before randomization"
- Procedure: "treatment"
- Condition: "pulmonary embolism"
- Non-representable: "The patient should be randomized no earlier than 24 hours after procedures endovascular mechanical thrombus fragmentation + thrombolytic therapy"